Clinical trial inclusion criteria:
Age = 18 years
Laparoscopic cholecystectomy
Emergent/elective
=2 risk factors: diabetes mellitus, age =70 years, BMI =30, fascial enlargement

Annotated entities:
- Person: "Age"
- Value: "= 18 years"
- Procedure: "cholecystectomy"
- Qualifier: "Laparoscopic"
- Qualifier: "Emergent"
- Qualifier: "elective"
- Multiplier: "=2"
- Condition: "risk factors"
- Condition: "diabetes mellitus"
- Person: "age"
- Value: "=70 years"
- Measurement: "BMI"
- Value: "=30"
- Condition: "fascial enlargement"